NYHA II : Slight limitation of physical activity. Comfortable at rest, but ordinary physical activity results in undue breathlessness, fatigue or palpitation.

The above is a clinical trial inclusion criterion. Annotated with entity spans:
[Non-query-able: NYHA II : Slight limitation of physical activity. Comfortable at rest, but ordinary physical activity results in undue breathlessness, fatigue or palpitation].